Clinical trial exclusion criterion:
Coagulopathy

Annotated entities:
- Condition: "Coagulopathy"